Clinical trial inclusion criterion:
Treatment of the current flare with Pentasa® to induce a remission initiated by the patient, the general practitioner or the gastroenterologist, during the inclusion visit or during the week before the inclusion visit.

Annotated entities:
- Drug: "Pentasa"
- Procedure: "Treatment"
- Condition: "flare"
- Temporal: "during the inclusion visit"
- Reference_point: "inclusion visit"
- Temporal: "during the week before the inclusion visit"
- Reference_point: "the week before the inclusion visit"